Are currently enrolled in another smoking cessation trial

The above is a clinical trial exclusion criterion. Annotated with entity spans:
[Competing_trial: Are currently enrolled in another smoking cessation trial]